Renal disease,

The above is a clinical trial exclusion criterion. Annotated with entity spans:
[Condition: Renal disease],